下列有關中心漿液性脈絡視網膜病變（central serous chorioretinopathy, CSCR）之敘述，何者錯誤？
A. 視網膜感覺層（sensory retina）之漿液性剝離（serous detachment）
B. 症狀包括視物變大（macropsia）、視物顏色改變（dyschromatopsia）
C. 有可能反覆發生
D. 大多數病患會自行好轉

正確答案：B. 症狀包括視物變大（macropsia）、視物顏色改變（dyschromatopsia）